¿Cuál de los siguientes signos es característico de un paciente con insuficiencia cardiaca izquierda?:
1. Estertores.
2. Aumento de la presión arterial.
3. Disminución de peso.
4. Ascitis.
5. Bradicardia.

Respuesta correcta: 1. Estertores.